The Mantoux test detects what latent infection/disease?

screened for TB infection with a Mantoux tuberculin skin test